Clinical trial exclusion criterion:
Planned elective surgery within 30 days of the Final Study Visit.

Entity relations:
- Has_mood("elective surgery", "Planned")
- Has_index("within 30 days of the Final Study Visit", "Final Study Visit")
- Has_temporal("elective surgery", "within 30 days of the Final Study Visit")